¿A partir de qué células se origina el esclerotomo?
1. Mesodermo paraaxial.
2. Mesodermo intermedio.
3. Mesodermo lateral.
4. Cordomesodermo.

Respuesta correcta: 1. Mesodermo paraaxial.